Male or female who is among 20 to 80 years of age at screening.

The above is a clinical trial inclusion criterion. Annotated with entity spans:
[Person: Male] or [Person: female] who is among [Value: 20 to 80 years] of [Person: age] [Temporal: at screening].